Clinical trial exclusion criterion:
Previous thoracic operation in the same side.

Annotated entities:
- Temporal: "Previous"
- Procedure: "thoracic operation"
- Qualifier: "same side"